膈下動脈（inferior phrenic artery）源自：
A. 胸內動脈（internal thoracic artery）
B. 腹腔動脈幹（celiac trunk）
C. 腹主動脈（abdominal aorta）
D. 腎動脈（renal artery）

正確答案：C. 腹主動脈（abdominal aorta）